Clinical trial inclusion criterion:
Singleton pregnancy

Annotated entities:
- Condition: "Singleton pregnancy"